一位 56 歲女性病患，大腦血管攝影發現有一顆後交通動脈瘤（posterior communicating artery aneurysm），該動脈瘤接觸到大腦顳葉（temporal lobe），這位病患最有可能的症狀是那一種？
A. 意識喪失（loss of consciousness）
B. 第三對顱神經麻痺（3rd cranial nerve palsy）
C. 在大腦血管攝影前後像可看到動脈瘤在頸內動脈內側突出（projection of the aneurysm medial to the
D. 癲癇（seizure）

正確答案：B. 第三對顱神經麻痺（3rd cranial nerve palsy）